下列何者不是豎脊肌（erector spinae）的一部分？
A. 髂肋肌（iliocostalis）
B. 最長肌（longissimus）
C. 多裂肌（multifidus）
D. 棘肌（spinalis）

正確答案：C. 多裂肌（multifidus）